1. bilateral AT

The above is a clinical trial exclusion criterion. Annotated with entity spans:
1. [Condition: bilateral AT]